Has any clinically significant condition or situation that would interfere with the trial evaluations or participation in the trial

The above is a clinical trial exclusion criterion. Annotated with entity spans:
[Post-eligibility: Has any clinically significant condition or situation that would interfere with the trial evaluations or participation in the trial]